La reabsorción de glucosa en la nefrona:
1. No tiene tasa máxima.
2. Es inferior al 50% de la filtrada.
3. Se realiza en el túbulo proximal.
4. Está mediada por la insulina.
5. Es por difusión simple.

Respuesta correcta: 3. Se realiza en el túbulo proximal.